酒精戒斷症狀可能因人而異，可分為四大類包含：①知覺障礙（如：幻覺） ②震顫（tremulousness）  ③抽搐（seizure） ④譫妄（delirium tremens）；雖未必人人有一樣的發作順序，但若以最典型的發生時序，中斷飲用酒精後，依先後排序為何？
A. ③①④②
B. ①③②④
C. ④②③①
D. ②①③④

正確答案：D. ②①③④